下列何者不是連接不同骨頭間的韌帶？
A. 胸鎖韌帶（sternoclavicular ligament）
B. 喙肩韌帶（coracoacromial ligament）
C. 喙鎖韌帶（coracoclavicular ligament）
D. 喙肱韌帶（coracohumeral ligament）

正確答案：B. 喙肩韌帶（coracoacromial ligament）